Clinical trial inclusion criterion:
First presentation of AIH requiring treatment according to the current EASL guidelines

Entity relations:
- AND("AIH", "treatment")